Clinical trial exclusion criterion:
7. Patient known to be Human Immunodeficiency Virus (HIV)-positive

Entity relations:
- Has_value("Human Immunodeficiency Virus (HIV)", "positive")